最容易造成移植後糖尿病之免疫抑制劑為：
A. cyclosporine
B. tacrolimus
C. mycophenolate mofetil
D. sirolimus

正確答案：B. tacrolimus